何種頭痛發作時，讓患者吸入 100% 的氧氣 15 分鐘是有效的治療？
A. 預兆偏頭痛（Migraine with aura）
B. 無預兆偏頭痛（Migraine without aura）
C. 緊張型頭痛（Tension-type headache）
D. 叢發性頭痛（Cluster headache）

正確答案：D. 叢發性頭痛（Cluster headache）